Clinical trial exclusion criterion:
eGFR<40 ml/min at time of possible conversion

Annotated entities:
- Measurement: "eGFR"
- Value: "<40 ml/min"
- Temporal: "at time of possible conversion"